下列何者為具厚壁球形體（spherules）以及關節孢子（arthroconidia）之真菌？
A. 鬚髮癬菌（Trichophyton mentagrophytes）
B. 申克孢子絲菌（Sporothrix schenckii）
C. 莢膜組織胞漿菌（Histoplasma capsulatum）
D. 粗球孢子菌（Coccidioides immitis）

正確答案：D. 粗球孢子菌（Coccidioides immitis）